Clinical trial exclusion criterion:
Allergy to Glitazones

Entity relations:
- AND("Allergy", "Glitazones")